En el sistema parasimpático:
1. La neurona preganglionar está en médula espinal torácica.
2. Las neuronas postganglionares tienen axones cortos.
3. Las fibras postganglionares liberan noradrenalina.
4. Las neuronas postganglionares tiene receptores muscarínicos.
5. Numerosas neuronas inervan el músculo liso vascular de las extremidades.

Respuesta correcta: 2. Las neuronas postganglionares tienen axones cortos.